85 歲男性因家人注意到倦怠不語，記憶力喪失約有二星期，今早因發燒、意識不清、呼吸急促來診，過去史有慢性肺疾、攝護腺肥大併泌尿道感染，身體檢查發現體溫 40℃，脈搏 140/min，規刖，血壓 138/56 mmHg，在右肺聽診有 crackles，心臟大小、心音皆正常，腳部並無水腫，腹部及神經檢查並無特別發現，血液檢查白血球 16290/μL、Hb 10.6 g/dL、血小板 18 萬/μL、白蛋白 3.4 g/dL、BUN  mg/dL、Cr 1.0 mg/dL、Na 141 meq/L、K 4.6 meq/L、Ca 2.1 meq/L、血糖 108 mg/dL，尿液檢查 glucose 0.25 g/dL、WBC 2~5/HPF、RBC 60~80/HPF，胸部 X-光呈現兩側下肺野浸潤稍增。則下列措施何者不適當？
A. 給予適當輸液治療
B. 給予嘗試性抗生素治療
C. 給予毛地黃治療
D. 做腦部核磁共振檢查

正確答案：C. 給予毛地黃治療